Clinical trial inclusion criterion:
No signs of poor peripheral perfusion

Entity relations:
- Has_mood("poor peripheral perfusion", "signs of")
- Has_negation("poor peripheral perfusion", "No")